Clinical trial exclusion criterion:
Presence of adnexal mass.

Annotated entities:
- Condition: "adnexal mass"